Clinical trial exclusion criterion:
taking any prescription pain/ insulin medication

Entity relations:
- OR("prescription insulin medication", "prescription pain medication")